Clinical trial inclusion criterion:
Patients undergoing total knee arthroplasty under spinal anaesthesia

Entity relations:
- AND("total knee arthroplasty", "spinal anaesthesia")